Patients with bone metastases as the only site(s) of measurable disease

The above is a clinical trial exclusion criterion. Annotated with entity spans:
Patients with [Condition: bone metastases] as the [Multiplier: only site(s) of measurable disease]